Clinical trial exclusion criterion:
Asplenia (absence of spleen or its removal);

Annotated entities:
- Condition: "Asplenia"
- Negation: "absence of"
- Condition: "spleen"
- Procedure: "spleen removal"